Clinical trial inclusion criterion:
Group I PAH, defined as a mPAP=25mmHg, PCWP<15mmHg and PVR[The PVR =(mPAP-PCWP)/CO]>3.0 Woods unit.

Entity relations:
- Has_qualifier("PAH", "Group I")
- Has_value("mPAP", "=25mmHg")
- Has_value("PCWP", "<15mmHg")
- Subsumes("PVR", "(mPAP-PCWP)/CO")
- Has_value("PVR", ">3.0 Woods unit")
- Subsumes("PAH", "mPAP")